En la formación de los aminoacil tRNA por las aminoacil tRNA sintetasas:
1. El aminoácido adecuado se une al extremo 5´ del tRNA correspondiente.
2. El aminoácido se une primero a la adenosina monofosfato (AMP).
3. El paso de activación necesita la hidrólisis del grupo fosfato terminal del GTP.
4. Sólo un tipo de tRNA sirve como sustrato para cada aminoácido.

Respuesta correcta: 2. El aminoácido se une primero a la adenosina monofosfato (AMP).